下列何者不是急性腎衰竭病人接受緊急血液透析治療的適應症？
A. BUN 120 mg/dL，creatinine 2.5 mg/dL
B. 血鉀值大於 7 mEq/L，且 Kayexalate（sodium polystyrene sulfonate）治療效果不佳
C. 心包膜積水
D. 肺水腫

正確答案：A. BUN 120 mg/dL，creatinine 2.5 mg/dL